Clinical trial exclusion criteria:
Patients attending for a therapeutic endoscopic procedure e.g. variceal banding, stent insertion, balloon dilatation.
Patients with a known diagnosis e.g. upper gastrointestinal cancer
Patients previously treated with HP eradication therapy
Patients who had taken PPI, H2 receptor antagonists and antibiotics within 4 weeks
Patients with acute gastrointestinal bleeding
Patients who'd had previous gastric surgery
Patients with chronic liver disease
Patients with abnormal coagulation or any other contra-indication to use of standard biopsy in routine diagnostic endoscopic procedures
Patients who are unable or unwilling to give informed consent
Patients under the age of 18 years

Annotated entities:
- Procedure: "therapeutic endoscopic procedure"
- Procedure: "variceal banding"
- Procedure: "stent insertion"
- Procedure: "balloon dilatation"
- Condition: "upper gastrointestinal cancer"
- Condition: "known diagnosis"
- Procedure: "HP eradication therapy"
- Drug: "PPI"
- Drug: "H2 receptor antagonists"
- Drug: "antibiotics"
- Temporal: "within 4 weeks"
- Grammar_Error: "and"
- Condition: "gastrointestinal bleeding"
- Qualifier: "acute"
- Procedure: "gastric surgery"
- Temporal: "previous"
- Procedure: "liver disease"
- Qualifier: "chronic"
- Condition: "abnormal coagulation"
- Condition: "contra-indication"
- Procedure: "standard biopsy"
- Procedure: "diagnostic endoscopic procedures"
- Non-query-able: "Patients who are unable or unwilling to give informed consent"
- Person: "age"
- Value: "under 18 years"